Clinical trial exclusion criterion:
Patients who have undergone surgery within 24 hours prior to the study sonographic examination.

Annotated entities:
- Procedure: "surgery"
- Temporal: "within 24 hours prior to the study sonographic examination"
- Reference_point: "the study sonographic examination"
- Procedure: "sonographic examination"